What types of anti-tumor therapeutic antibodies are available?

Anti-tumor therapeutic antibodies include single-targeted antibodies, bi-specific antibodies (BsAbs), and antibody-drug conjugates (ADCs).